Clinical trial inclusion criterion:
Routine bloods including U&E, FBC, LFTs, inflammatory markers (CRP) and albumin will be measured.

Annotated entities:
- Procedure: "Routine bloods"
- Procedure: "U&E"
- Procedure: "FBC"
- Procedure: "LFTs"
- Procedure: "inflammatory markers (CRP)"
- Procedure: "albumin"